intrauterine hormonal apparatus

The above is a clinical trial exclusion criterion. Annotated with entity spans:
[Device: intrauterine hormonal apparatus]